Clinical trial exclusion criterion:
History of seizure disorder or at increased risk for development of a seizure disorder including, but not limited to, complicated febrile seizure and history of significant head injury.

Entity relations:
- Subsumes("seizure disorder", "complicated febrile seizure")
- OR("complicated febrile seizure", "head injury")